Clinical trial exclusion criterion:
Breast-feeding.

Annotated entities:
- Observation: "Breast-feeding"